Clinical trial exclusion criteria:
Coagulopathies (with prothrombin concentration less than 60% or INR more than 1.5)
In-ability to postpone anti-coagulation medications.
Infection or injury or a lesion at the block site.
Suspected cervical vertebral column injury necessitating using a neck collar.
A compromised lung on the contralateral side of the block (Pneumothorax, hemothorax or Pneumonectomy).
Traumatic vascular injuries or operative interventions (Surgical harvesting) involving arteries of the upper limb on the operative side.
Patients with communication difficulties.
Hypersensitivity to local anesthetics and/or Dexamethasone.
Patients on perioperative intravenous (IV) steroids.

Annotated entities:
- Condition: "Coagulopathies"
- Measurement: "prothrombin concentration"
- Value: "less than 60%"
- Value: "more than 1.5"
- Measurement: "INR"
- Drug: "anti-coagulation medications"
- Mood: "In-ability to postpone"
- Condition: "Infection"
- Condition: "injury"
- Condition: "lesion"
- Qualifier: "at the block site"
- Condition: "cervical vertebral column injury"
- Mood: "Suspected"
- Condition: "compromised lung"
- Qualifier: "contralateral side of the block"
- Condition: "Pneumothorax"
- Condition: "hemothorax"
- Condition: "Pneumonectomy"
- Condition: "Traumatic vascular injuries"
- Procedure: "operative interventions"
- Procedure: "Surgical harvesting"
- Qualifier: "arteries of the upper limb on the operative side"
- Condition: "communication difficulties"
- Condition: "Hypersensitivity"
- Drug: "local anesthetics"
- Drug: "Dexamethasone"
- Temporal: "perioperative"
- Drug: "intravenous (IV) steroids"